34歲女性，身高152公分，體重96公斤，未曾有過性經	，因陰道出血半年前來求診，據她敘述出血量時多時少，曾看過幾家醫院和診所，並接受荷爾蒙治療，未見效。初經11歲，頭幾年月經規則且正常，往後體重逐漸增加，月經不規則，常數月來一次，每次經量多，經期長。經檢查血壓90/60 mmHg，脈搏90下/min，體溫37℃，臉色蒼白，Hb 5.5 g/dL，腹部超音波顯示子宮稍大，子宮內膜增厚不規則約3.2 cm，雙側附屬物未看到，欲內診（骨盆腔檢查）時，發現處女膜完整，此時下列處置何者為佳？
A. 給予高劑量雌激素（estrogen）以達止血效果
B. 給予高劑量黃體素（progesterone）以達止血效果
C. 建議接受子宮內膜切片
D. 給予GnRH agonist以達止血效果

正確答案：C. 建議接受子宮內膜切片